Clinical trial exclusion criterion:
Newborn infants <28 weeks and >34 weeks gestation, those with life threatening illness, congenital and chromosomal anomalies, gastrointestinal anomalies or necrotizing enterocolitis and fed premature formula

Annotated entities:
- Person: "Newborn infants"
- Measurement: "gestation"
- Value: "<28 weeks and >34 weeks"
- Condition: "life threatening illness"
- Condition: "chromosomal anomalies"
- Condition: "anomalies congenital"
- Condition: "gastrointestinal anomalies"
- Condition: "necrotizing enterocolitis"
- Observation: "fed premature formula"